Los nervios craneales motores:
1. Tienen sus somas en los ganglios dorsales de la región cervical.
2. Se originan en el tronco del encéfalo.
3. Reciben el nombre de la región medular por la que salen.
4. Pertenecen solo al sistema nervioso somático.
5. Se originan en la corteza cerebral.

Respuesta correcta: 2. Se originan en el tronco del encéfalo.